下列有關 adoptive T-cell transfer 用於腫瘤免疫治療的敘述，那一項錯誤？
A. 自健康人體內純化 T 細胞在體外刺激後打回癌症病人的療法
B. T 細胞體外活化需要 IL-2 細胞激素刺激
C. T 細胞可以經由抗原呈獻細胞（antigen presenting cells）活化
D. T 細胞活化後仍保有記憶性（memory）

正確答案：A. 自健康人體內純化 T 細胞在體外刺激後打回癌症病人的療法